下列那一構造可以用銀染法染成黑色？
A. 纖維軟骨（fibrocartilage）
B. 彈性纖維（elastic fiber）
C. 網狀纖維（reticular fiber）
D. 膠原纖維（collagen fiber）

正確答案：C. 網狀纖維（reticular fiber）